mechanical valve prosthesis;

The above is a clinical trial exclusion criterion. Annotated with entity spans:
[Device: mechanical valve prosthesis];